pectus carinatum, Poland's syndrome, or any chest wall anomaly other than pectus excavatum

The above is a clinical trial exclusion criterion. Annotated with entity spans:
[Condition: pectus carinatum], [Condition: Poland's syndrome], or any [Condition: chest wall anomaly] [Negation: other than] [Condition: pectus excavatum]